一位 38 歲女性，因為甲狀腺乳突癌（papillary carcinoma of thyroid）接受甲狀腺切除術。術後病人常感兩側手腕與臉部肌肉有抽搐的現象。以下何者是最可能的抽血資料？
A. 血清鈣離子（calcium ion）升高，血清磷酸根離子（phosphate）降低，血清副甲狀腺荷爾蒙（parathyroid hormone）升高
B. 血清鈣離子（calcium ion）升高，血清磷酸根離子（phosphate）升高，血清副甲狀腺荷爾蒙（parathyroid hormone）升高
C. 血清鈣離子（calcium ion）降低，血清磷酸根離子（phosphate）升高，血清副甲狀腺荷爾蒙（parathyroid hormone）降低
D. 血清鈣離子（calcium ion）降低，血清磷酸根離子（phosphate）降低，血清副甲狀腺荷爾蒙（parathyroid hormone）降低

正確答案：C. 血清鈣離子（calcium ion）降低，血清磷酸根離子（phosphate）升高，血清副甲狀腺荷爾蒙（parathyroid hormone）降低